What is the asosciation between the eustachian tube and the palatine muscle of the uvula?

Palatal musculature is known to be responsible for the active opening of the eustachian (auditory) tube.